List adipokines.

adiponectin
leptin
resistin